下列那些為脂溶性維生素？① 維生素 A ② 維生素 B ③ 維生素 C ④ 維生素 D ⑤ 維生素 E
A. ① ② ③
B. ② ③ ④
C. ③ ④ ⑤
D. ① ④ ⑤

正確答案：D. ① ④ ⑤